有關重症肌無力（myasthenia gravis）的敘述，何者錯誤？
A. 眼部症狀以眼瞼下垂或複視表現
B. 老年人患有此症者要檢查是否患有胸腺瘤
C. 靜脈注射 edrophonium chloride 可幫助診斷
D. 可以注射肉毒桿菌素（botulinum toxin）來治療

正確答案：D. 可以注射肉毒桿菌素（botulinum toxin）來治療